Planned primary percutaneous coronary intervention

The above is a clinical trial inclusion criterion. Annotated with entity spans:
[Mood: Planned] [Procedure: primary percutaneous coronary intervention]